Sobre la succinato deshidrogenasa es correcto afirmar:
1. Su producto es el malato.
2. Genera poder reductor en forma de FADH2.
3. Su sustrato es el fumarato.
4. Participa en la gluconeogénesis.

Respuesta correcta: 2. Genera poder reductor en forma de FADH2.